Previous exposure to secukinumab or any other biologic drug directly targeting Interleukin-17 (IL-17), Interleukin-12/23 (IL-12/23), or the IL-17 receptor, or any other biologic immunomodulating agent, except those targeting TNFa

The above is a clinical trial inclusion criterion. Annotated with entity spans:
Previous exposure to [Drug: secukinumab] or any [Qualifier: other] [Drug: biologic drug] directly [Condition: targeting] [Drug: Interleukin-17 (IL-17)], [Drug: Interleukin-12/23 (IL-12/23)], or the [Drug: IL-17 receptor], or any other [Drug: biologic immunomodulating agent], [Negation: except] those targeting [Drug: TNFa]